Clinical trial exclusion criterion:
patients with twin pregnancy;

Entity relations:
- Has_qualifier("pregnancy", "twin")